Clinical trial inclusion criterion:
Need for intravenous fluid therapy

Entity relations:
- Has_mood("intravenous fluid therapy", "Need for")